Clinical trial inclusion criteria:
Patient has provided signed informed consent
Patient is aged greater than or equal to 40 and less than or equal to 89 years of age
Patient has a prostate size between 90g and 200g, as determined by MRI
Patient has experienced lower urinary tract symptoms (LUTS) for at least 6 months prior to study enrollment
Patient has an IPSS score of at least 13 at baseline
Patient is either: refractory to medical treatment, contraindicated to medical treatment, OR refuses medical treatment
Patient either: refuses surgical treatment OR is contraindicated for surgical treatment
Patient meets ONE of the following criteria: baseline PSA < 4.0ng/mL (no prostate biopsy required) OR baseline PSA >/= 4 ng/mL AND a negative prostate biopsy (minimum 12 core biopsy) within the prior 12 months

Annotated entities:
- Observation: "signed informed consent"
- Value: "greater than or equal to 40"
- Person: "aged"
- Value: "less than or equal to 89 years"
- Value: "between 90g and 200g"
- Measurement: "prostate size"
- Procedure: "MRI"
- Condition: "lower urinary tract symptoms (LUTS)"
- Temporal: "at least 6 months prior to study enrollment"
- Reference_point: "study enrollment"
- Measurement: "IPSS score"
- Value: "at least 13"
- Temporal: "at baseline"
- Reference_point: "baseline"
- Condition: "refractory to medical treatment"
- Condition: "contraindicated to medical treatment"
- Condition: "refuses medical treatment"
- Condition: "refuses surgical treatment"
- Condition: "contraindicated for surgical treatment"
- Measurement: "PSA"
- Temporal: "baseline"
- Value: "< 4.0ng/mL"
- Measurement: "PSA"
- Temporal: "baseline"
- Value: ">/= 4 ng/mL"
- Measurement: "prostate biopsy"
- Value: "negative"
- Multiplier: "minimum 12"
- Procedure: "core biopsy"
- Temporal: "within the prior 12 months"